Clinical trial inclusion criterion:
18-80 years old;

Annotated entities:
- Person: "old"
- Value: "18-80 years old"